下列何者是 DNA 片段 5'- ATTGCAG-3' 的互補核酸股？
A. 5'- CUGCAAU- 3'
B. 5'- TAACGTC- 3'
C. 5'- ATTCGTC- 3'
D. 5'- ATTGCAG- 3'

正確答案：A. 5'- CUGCAAU- 3'